Clinical trial inclusion criterion:
Documented history of type 2 diabetes mellitus.

Annotated entities:
- Condition: "type 2 diabetes mellitus"